Clinical trial exclusion criterion:
have experienced 1 or more falls in the last month before the study

Annotated entities:
- Multiplier: "1 or more"
- Observation: "falls"
- Temporal: "in the last month before the study"
- Reference_point: "last month before the study"